5. Active and uncontrolled malignancy

The above is a clinical trial exclusion criterion. Annotated with entity spans:
[Parsing_Error: 5.] [Temporal: Active] and [Qualifier: uncontrolled] [Condition: malignancy]